Treated with intramuscular or intravenous corticosteroids in the last 6 months for RA activity

The above is a clinical trial exclusion criterion. Annotated with entity spans:
Treated with [Qualifier: intramuscular] or [Qualifier: intravenous] [Drug: corticosteroids] [Temporal: in the last 6 months] for [Condition: RA] activity